Clinical trial inclusion criterion:
history of any stroke, transient ischemic attack or intracranial bleeding

Entity relations:
- OR("stroke", "transient ischemic attack", "intracranial bleeding")